Clinical trial exclusion criterion:
Chronic treatment with strong CYP3A4 inhibitor/ inducer, acid reducing agent, Proton pump inhibitors

Entity relations:
- OR("strong CYP3A4 inhibitor", "acid reducing agent", "strong CYP3A4 inducer", "Proton pump inhibitors")